La evaluación de la emoción expresada resulta útil en el contexto del tratamiento psicológico de la esquizofrenia. Pero ¿de qué esfera forma parte habitualmente la evaluación de la emoción expresada?:
1. De la evaluación de síntomas.
2. De la evaluación del insight.
3. De la evaluación cognitiva.
4. De la evaluación familiar.
5. De la evaluación racional-emotiva.

Respuesta correcta: 4. De la evaluación familiar.